一個青春期少女，月經從初經開始週期即不正常，最近因二個週期月經不來而求診，最優先的處置是：
A. 懷孕試
B. 給予黃體素（progestin）
C. 觀察
D. 給予動情激素（estrogen）

正確答案：A. 懷孕試